下列何者會先通過坐骨大孔，再通過坐骨小孔？
A. 上孖肌
B. 梨狀肌
C. 閉孔內肌
D. 陰部神經

正確答案：D. 陰部神經